Clinical trial exclusion criterion:
previous fracture in finger to be treated, which affects range of motion of MP or PIP joint

Annotated entities:
- Qualifier: "finger to be treated"
- Condition: "fracture"
- Temporal: "previous"
- Condition: "affects range of motion"
- Qualifier: "MP joint"
- Qualifier: "PIP joint"